Clinical trial exclusion criterion:
Concomitant antiplatelet or anticoagulant use

Entity relations:
- Has_temporal("antiplatelet", "Concomitant")
- Has_temporal("anticoagulant", "Concomitant")
- OR("antiplatelet", "anticoagulant")